Symptoms of which disorder are evaluated with the Davidson Trauma Scale?

Davidson Trauma Scale is used for evaluation of post-traumatic stress disorder.